Clinical trial exclusion criterion:
Adjuvant chemotherapy

Annotated entities:
- Procedure: "Adjuvant chemotherapy"